5. AML or antecedent MDS secondary to prior chemotherapy

The above is a clinical trial exclusion criterion. Annotated with entity spans:
5. [Condition: AML] or [Temporal: antecedent] [Condition: MDS] secondary to [Temporal: prior] [Condition: chemotherapy]